What is disrupted by ALS- and FTD-associated missense mutations in TBK1?

ALS- and FTD-associated missense mutations in TBK1 differentially disrupt mitophagy.